Uncontrolled epilepsy (seizure within 6 months prior to consent)

The above is a clinical trial exclusion criterion. Annotated with entity spans:
[Condition: Uncontrolled epilepsy] ([Condition: seizure] [Value: within 6 months prior to consent])